Clinical trial exclusion criterion:
Hepatic or renal disease

Annotated entities:
- Condition: "renal disease"
- Condition: "Hepatic disease"